有關血管加壓素（vasopressin）的描述，下列何者錯誤？
A. 主要由腦下垂體後葉（posterior pituitary）所分泌，具有促進血管收縮的作用
B. 於腸胃道中容易被破壞，因此口服無效
C. 可以用來治療垂體性尿崩症（pituitary diabetes insipidus）
D. 具有利尿的作用，因此會造成水分與鈉離子流失

正確答案：D. 具有利尿的作用，因此會造成水分與鈉離子流失